El valor de la ingesta diaria admitida (IDA) de un aditivo alimentario puede ser calculado a partir del siguiente dato obtenido previamente en animales:
1. Nivel sin efecto adverso observado (NOAEL).
2. Menor nivel con efecto adverso observado (LOAEL).
3. Margen de seguridad (MOS).
4. Intervalo tóxico (IT).
5. Valor límite de toxicidad (TLV).

Respuesta correcta: 1. Nivel sin efecto adverso observado (NOAEL).